Clinical trial exclusion criterion:
(7)Patients currently taking folate, B12, or B6, or any compounds containing them, who express an inability or a refusal to stop usage;

Entity relations:
- Has_temporal("folate", "currently")
- OR("folate", "B12", "B6")
- OR("inability", "refusal to stop usage")